Clinical trial exclusion criterion:
St. John's Wort

Annotated entities:
- Drug: "St. John's Wort"